¿Qué nombre recibe la co-ocurrencia a un mismo tiempo de un trastorno mental o del comportamiento con un trastorno por consumo de sustancias?:
1. Diagnóstico diferencial.
2. Patología dual.
3. Curso del trastorno.
4. Etiología.

Respuesta correcta: 2. Patología dual.